What is the mechanism of action of eprotirome?

Eprotirome belongs to thyromimetics and has selective TRβ1 activity. It has shown to be effective in dyslipidemia by the lipid-lowering action of TH in the liver and also in obesity.